Patients less than 16 years old with newly diagnosed PML-RARa positive acute promyelocytic leukemia.

The above is a clinical trial inclusion criterion. Annotated with entity spans:
Patients [Value: less than 16 years] [Person: old] with newly diagnosed [Measurement: PML-RARa] [Value: positive] [Condition: acute promyelocytic leukemia].